¿Cuál de las siguientes opciones es FALSA en relación al tumor mucinoso papilar intraductal pancreático?
1. Se consideran lesiones premalignas.
2. Pueden afectar tanto al conducto pancreático principal como a las ramas secundarias y se caracterizan por presentar epitelio productor de mucina.
3. La presencia de nódulos en la pared de la lesión no constituye un signo de alarma.
4. Cuando afecta a las ramas secundarias, la resección quirúrgica está indicada si es mayor de 3 cm.

Respuesta correcta: 3. La presencia de nódulos en la pared de la lesión no constituye un signo de alarma.